Clinical trial exclusion criterion:
Delirium

Annotated entities:
- Condition: "Delirium"